1. Males and females age ≥18 years in second relapse or refractory.

The above is a clinical trial inclusion criterion. Annotated with entity spans:
1. [Person: Males] and [Person: females] [Person: age] [Value: ≥18 years] in [Multiplier: second] [Condition: relapse] or [Condition: refractory].